Clinical trial exclusion criterion:
Any significant acute or chronic medical illness or problem, including, but not limited to, diabetes, hypertension, cardiac disease, asthma, chronic obstructive lung disease

Annotated entities:
- Condition: "diabetes"
- Condition: "hypertension"
- Condition: "cardiac disease"
- Condition: "asthma"
- Condition: "chronic obstructive lung disease"
- Condition: "medical illness"
- Qualifier: "acute"
- Qualifier: "chronic"